Clinical trial inclusion criterion:
Taking most recent DMT continuously* for no less than two years.

Entity relations:
- Has_temporal("DMT", "for no less than two years")
- Has_multiplier("DMT", "continuously")